一位新生兒出生後發現呼吸窘迫，肺臟發育不良。追蹤其母親懷孕時，即診斷羊水過少，新生兒超音波發現兩側腎臟腫大，且 echogenecity 增加，下列敘述何者錯誤？
A. 基因上可能是 chromosome 6 之 short arm 出問題
B. 最有可能是 autosomal dominant polycystic kidney disease
C. 此類新生兒常合併肝臟疾病
D. 常死於呼吸衰竭

正確答案：B. 最有可能是 autosomal dominant polycystic kidney disease